Clinical trial inclusion criterion:
free from sleep apnea

Entity relations:
- Has_negation("sleep apnea", "free from")